Chronic kidney disease

The above is a clinical trial exclusion criterion. Annotated with entity spans:
[Qualifier: Chronic] [Condition: kidney disease]